Clinical trial exclusion criterion:
Severe renal insufficiency (Creatinine Clearance < 30 ml/min).

Entity relations:
- Has_qualifier("renal insufficiency", "Severe")
- Has_value("Creatinine Clearance", "< 30 ml/min")
- Subsumes("renal insufficiency", "Creatinine Clearance")